Clinical trial exclusion criterion:
High risk of bleeding

Annotated entities:
- Qualifier: "High risk"
- Condition: "bleeding"